Clinical trial exclusion criterion:
8. Immunosuppressants: cyclosporin, everolimus, sirolimus

Annotated entities:
- Parsing_Error: "8."
- Drug: "cyclosporin"
- Drug: "everolimus"
- Drug: "sirolimus"